Clinical trial exclusion criterion:
In the Investigator's opinion, is at high risk for infection (e.g., indwelling catheter, dysphagia with aspiration, decubitus ulcer, history of prior aspiration pneumonia or recurrent urinary tract infection)

Entity relations:
- Has_qualifier("risk for infection", "high")
- AND("dysphagia", "aspiration")
- Has_qualifier("urinary tract infection", "recurrent")
- AND("risk for infection", "indwelling catheter")
- OR("indwelling catheter", "dysphagia", "decubitus ulcer", "aspiration pneumonia", "urinary tract infection")